Clinical trial inclusion criterion:
Female age 20-50 y/o who plan to undergo abdominal myomectomy for symptomatic myomatous uterus

Entity relations:
- Has_qualifier("myomatous uterus", "symptomatic")
- AND("abdominal myomectomy", "myomatous uterus")
- Has_mood("abdominal myomectomy", "plan to undergo")
- Has_value("age", "20-50 y/o")